若腦中風病人出現認知（cognition）功能失常，行為改變，其病變位置最常發生在下列何部位？
A. 額（frontal）葉
B. 頂（parietal）葉
C. 顳（temporal）葉
D. 枕（occipital）葉

正確答案：A. 額（frontal）葉